提肛肌（Levator ani muscle）包括下列那一肌肉？
A. Piriformis
B. Gluteus major
C. Sphincter ani externus
D. Pubococcygeus

正確答案：D. Pubococcygeus